一位 25 歲男性業務員，三個月前與家人在外野餐時，突發性的出現極度害怕的感覺、坐立不安、心跳加速、呼吸急促、胸痛、喉嚨異物感、強烈的害怕死亡與失控，以上的不適持續 15 分鐘後隨即消失，爾後這樣子的發作一週約 2 到 3 次，於戶外或家中皆曾發生，對他的生活與工作造成極大的影響。下列對於此病人的描述，何者有誤？
A. 過度飲用咖啡或吸入尼古丁（nicotine）會使症狀惡化
B. 個案出現陣發性的發作，是一種典型的畏懼症（phobia）
C. 須評估個案是否有甲狀腺功能異常和精神物質相關的疾病（substance-related disorder）
D. 對於個案的胸痛，要謹慎評估其心臟病的危險因子

正確答案：B. 個案出現陣發性的發作，是一種典型的畏懼症（phobia）